history of substance abuse or current excessive use of alcohol

The above is a clinical trial exclusion criterion. Annotated with entity spans:
[Temporal: history] of [Condition: substance abuse] or [Temporal: current] [Condition: excessive use of alcohol]